一位5歲的男童幾天前有呼吸道感染，這兩天出現眼皮浮腫，陰囊水腫。尿液檢查顯示尿蛋白>300 mg/dL，RBC 0～2/HPF，血中白蛋白1.9 gm/dL，醫師給予類固醇治療4週之後，再次檢測尿蛋白為陰性反應，下列何者最可能是男童的診斷？
A. 微小變化型腎病變 （minimal change nephropathy）
B. IgA腎炎（IgA nephritis）
C. 局部巢狀絲球硬化（focal segmental glomerulosclerosis）
D. 膜性腎炎（membranous nephropathy）

正確答案：A. 微小變化型腎病變 （minimal change nephropathy）